Which computational methods are used for the definition of synteny?

The computational methods that are used for the definition of synteny are: multisyn, poff, orthocluster, phyldiag, synblast, cinteny, domainteam, mcscanx and run orthoclustersdb.